History of heart transplant or on a transplant list or with left ventricular (LV) assistance device.

The above is a clinical trial exclusion criterion. Annotated with entity spans:
[Temporal: History] of [Procedure: heart transplant] or [Mood: on a transplant list] or with [Device: left ventricular (LV) assistance device].